List the human genes encoding for the dishevelled proteins?

DVL-1
DVL-2
DVL-3